有一些細菌對 trimethoprim 產生抗性，其主要原因為何？
A. 此菌株的核糖體與 trimethoprim 的結合力降低
B. 此菌株的 dihydrofolate reductase 與 trimethoprim 的結合力降低
C. Trimethoprim 與此類菌之 rRNA 的結合力下降
D. Trimethoprim 與此類菌之 transpeptidase 的結合力下降

正確答案：B. 此菌株的 dihydrofolate reductase 與 trimethoprim 的結合力降低